Clinical trial exclusion criterion:
Gout

Annotated entities:
- Condition: "Gout"